Clinical trial exclusion criterion:
Tuberculosis resistant to any of the study drugs (isoniazid, rifampin, EMB, PZA, CFZ, Pto)

Annotated entities:
- Condition: "Tuberculosis"
- Qualifier: "resistant to"
- Drug: "study drugs"
- Drug: "isoniazid"
- Drug: "rifampin"
- Drug: "EMB"
- Drug: "PZA"
- Drug: "CFZ"
- Drug: "Pto"